Body mass index (BMI) of 35 kg/m2 or more.

The above is a clinical trial exclusion criterion. Annotated with entity spans:
[Measurement: Body mass index (BMI)] of [Value: 35 kg/m2 or more].